Clinical trial inclusion criteria:
need mechanical ventilation for more than 2 days
mean blood pressure more than 60mmHg
predicted ICU stay more than 7 days
tolerance of parenteral or enteral nutrition

Annotated entities:
- Procedure: "mechanical ventilation"
- Mood: "need"
- Multiplier: "for more than 2 days"
- Measurement: "mean blood pressure"
- Value: "more than 60mmHg"
- Observation: "predicted ICU stay"
- Value: "more than 7 days"
- Visit: "ICU"
- Condition: "tolerance"
- Procedure: "parenteral nutrition"
- Procedure: "enteral nutrition"